Clinical trial inclusion criterion:
BV positive by Nugent score

Annotated entities:
- Measurement: "BV"
- Value: "positive"
- Measurement: "Nugent score"